下列何者不屬於蜱媒介人畜共通感染症（tick-borne zoonoses）？
A. 萊姆病（Lyme disease）
B. 西尼羅病毒症（West Nile）
C. 巴貝氏原蟲症（babesiosis）
D. 落磯山斑疹熱（Rocky Mountain spotted fever）

正確答案：B. 西尼羅病毒症（West Nile）